Clinical trial exclusion criterion:
Contraindication to the study medication.

Annotated entities:
- Condition: "Contraindication"
- Drug: "study medication"